Clinical trial inclusion criterion:
Healthy men and women, age 40-75 yrs, without any disease and need of medication.

Entity relations:
- Has_qualifier("disease", "any")
- Has_negation("disease", "without")
- Has_value("age", "40-75 yr")
- Has_value("age", "40-75 yr")
- Has_qualifier("men", "Healthy")
- Has_negation("medication", "without")
- OR("men", "women")